Male or female, 18 years of age or older.

The above is a clinical trial inclusion criterion. Annotated with entity spans:
[Person: Male] or [Person: female], [Value: 18 years] of [Person: age] or older.